Clinical trial exclusion criterion:
History of kidney stones

Entity relations:
- Has_temporal("kidney stones", "History of")